Inability of oral drug intake

The above is a clinical trial exclusion criterion. Annotated with entity spans:
[Mood: Inability of] [Observation: oral drug intake]